Clinical trial inclusion criterion:
ASA 1-3

Annotated entities:
- Measurement: "ASA"
- Value: "1-3"